Clinical trial exclusion criterion:
a chronic use of non-steroidal anti-inflammatory drugs, (NSAID)

Entity relations:
- Subsumes("non-steroidal anti-inflammatory drugs", "NSAID")
- AND("chronic use", "non-steroidal anti-inflammatory drugs")